Clinical trial exclusion criterion:
patients with child class B and C liver disease

Entity relations:
- Has_value("child class", "B")
- AND("liver disease", "child class")
- OR("B", "C")